Clinical trial inclusion criterion:
Are psychologically stable and suitable for interventions determined by the investigator

Entity relations:
- Has_qualifier("psychologically stable", "determined by the investigator")
- Has_qualifier("suitable for interventions", "determined by the investigator")